¿Qué neurotransmisor tiene un tipo de receptor denominado muscarínico?:
1. Acetilcolina.
2. Dopamina.
3. Serotonina.
4. Noradrenalina.
5. Adrenalina.

Respuesta correcta: 1. Acetilcolina.